Which gene is responsible for the Liebenberg syndrome?

We re-define the phenotype of Liebenberg syndrome as a transformation of the upper limbs to reflect lower limb characteristics. We speculate that the area of deletion contains a regulatory sequence that suppresses the expression of PITX1 in the upper limb buds.